Clinical trial inclusion criterion:
Overweight and obese PCOS patients with newly diagnosed IGR;

Entity relations:
- Has_temporal("IGR", "newly diagnosed")
- OR("Overweight", "obese")